若長期攝取含有大量蛋白質但極少量澱粉的食物，則人體會出現下列何種症狀？
A. 尿液中的尿素含量會顯	減少
B. 體內會累積大量脂肪
C. 血液中酮體（ketone bodies）的含量會大幅升高
D. 極可能導致代謝性鹼中毒（metabolic alkalosis）

正確答案：C. 血液中酮體（ketone bodies）的含量會大幅升高